Clinical trial exclusion criterion:
severe behavioral issues

Annotated entities:
- Condition: "behavioral issues"
- Qualifier: "severe"